Carece de control hipotalámico:
1. Glucagón.
2. ACTH.
3. Prolactina.
4. GH.
5. LH.

Respuesta correcta: 1. Glucagón.